Clinical trial exclusion criterion:
Hemoglobin <1.05 g/dl at the time of initiation of therapy

Entity relations:
- Has_index("at the time of initiation of therapy", "initiation of therapy")
- Has_value("Hemoglobin", "<1.05 g/dl")
- Has_temporal("Hemoglobin", "at the time of initiation of therapy")